Describe SBGNview

SBGNview is a tool set for pathway based data visalization